Clinical trial inclusion criterion:
ASA I & II, Nulliparous and Multiparous, Spontaneous/Induced/Augmented Labor, Early active labor (cervix <5 cm (if known)), Pain (VPS) > 3, 18-45 years of age

Annotated entities:
- Measurement: "ASA"
- Value: "I & II"
- Condition: "Nulliparous"
- Condition: "Multiparous"
- Procedure: "Augmented Labor"
- Procedure: "Induced Labor"
- Condition: "Spontaneous Labor"
- Condition: "Early active labor"
- Measurement: "cervix"
- Value: "<5 cm"
- Measurement: "Pain (VPS)"
- Value: "> 3"
- Value: "18-45 years"
- Person: "age"